Clinical trial exclusion criterion:
Patient has previously received or is receiving an organ transplant other than a liver.

Entity relations:
- Has_negation("liver", "other than")
- Has_qualifier("organ transplant", "liver")